Clinical trial exclusion criterion:
The existence of subretinal hemorrhage area constituting =50% of total lesion area

Annotated entities:
- Measurement: "subretinal hemorrhage area"
- Value: "=50% of total lesion area"